Carbidopa與Levodopa合併用藥的原因為何？
A. 抑制周邊Dopa decarboxylase
B. 增加3-O-Methyldopa的量
C. 增加Tyrosine hydroxylase的活性
D. 抑制周邊COMT的活性

正確答案：A. 抑制周邊Dopa decarboxylase